La característica de los delirios que hace referencia al mantenimiento del delirio a lo largo del tiempo, a pesar de las evidencias en contra es:
1. La intensidad o convicción.
2. La inmodificabilidad, incorregibilidad o fijeza.
3. Presencia de apoyos culturales.
4. Preocupación.
5. Desviación comunicacional.

Respuesta correcta: 2. La inmodificabilidad, incorregibilidad o fijeza.